DSA > 1500 MFI

The above is a clinical trial exclusion criterion. Annotated with entity spans:
[Measurement: DSA] [Value: > 1500 MFI]